Which are the lipid lowering drugs administered in patients with Coronary Artery Disease (CAD)?

The lipid lowering drugs administered in patients with Coronary Artery Disease (CAD) are:
1) Statins
2) Fibrates
3) Resins
4) Niacin
5) Cholesterol absorption-inhibiting drugs.